Clinical trial inclusion criterion:
HIV negative or status unknown (as from the Ante-natal card)

Annotated entities:
- Condition: "HIV"
- Negation: "negative"
- Qualifier: "status unknown"